Clinical trial exclusion criterion:
Pulmonary disease necessitating home oxygen therapy

Annotated entities:
- Condition: "Pulmonary disease"
- Procedure: "home oxygen therapy"